Clinical trial inclusion criterion:
Post-bronchodilator spirometry will be performed approximately 15 minutes after the subject has self-administered 4 inhalations (i.e., total 400mcg) of albuterol/salbutamol via a metered dose inhaler (MDI )with a valved-holding chamber. The FEV1/FVC ratio and FEV1 percent predicted values will be calculated.

Annotated entities:
- Qualifier: "Post-bronchodilator"
- Temporal: "Post-bronchodilator"
- Drug: "bronchodilator"
- Reference_point: "bronchodilator"
- Procedure: "spirometry"
- Temporal: "approximately 15 minutes after"
- Multiplier: "4"
- Procedure: "inhalations"
- Qualifier: "self-administered"
- Multiplier: "400mcg"
- Drug: "albuterol"
- Drug: "salbutamol"
- Procedure: "metered dose inhaler (MDI )"
- Qualifier: "with a valved-holding chamber"